History of chronic pain

The above is a clinical trial exclusion criterion. Annotated with entity spans:
[Temporal: History] of [Condition: chronic pain]